Clinical trial exclusion criterion:
patient with a measure of legal protection

Annotated entities:
- Post-eligibility: "patient with a measure of legal protection"